Clinical trial exclusion criterion:
Patients at potential increased risk of iatrogenic probiotic infection (see Section 2.6 for detailed explanation) including specific immunocompromised populations (HIV <200 CD4 cells/µL, those receiving chronic immunosuppressive medications (e.g., azathioprine, cyclosporine, cyclophosphamide, tacrolimus, methotrexate, mycofenolate, Anti-IL2), previous transplantation (including stem cell) at any time, malignancy requiring chemotherapy in the last 3 months, neutropenia [absolute neutrophil count < 500]). However, patients receiving corticosteroids previously or presently or projected to receive corticosteroids are not excluded;

Entity relations:
- Has_value("CD4", "<200 cells/µL")
- AND("HIV", "CD4")
- Has_qualifier("immunosuppressive medications", "chronic")
- Subsumes("immunosuppressive medications", "azathioprine")
- Has_temporal("chemotherapy", "last 3 months")
- Has_value("absolute neutrophil count", "< 500]")
- AND("neutropenia", "absolute neutrophil count")
- Subsumes("risk of iatrogenic probiotic infection", "immunocompromised")
- Subsumes("immunocompromised", "HIV")
- OR("azathioprine", "cyclosporine", "cyclophosphamide", "tacrolimus", "methotrexate", "mycofenolate", "Anti-IL2")
- OR("immunocompromised", "immunosuppressive medications", "transplantation", "chemotherapy", "neutropenia")